Clinical trial inclusion criterion:
Patients who meet 1987 ACR criteria for SLE with 1996 modifications

Annotated entities:
- Measurement: "1987 ACR criteria with 1996 modifications"
- Condition: "SLE"